Clinical trial exclusion criterion:
have received influenza vaccination within the past 6 months

Annotated entities:
- Drug: "influenza vaccination"
- Temporal: "within the past 6 months"